What is the effect of Satb1 knock-out in mice?

knock-out of Satb1 significantly inhibited cell viability and migration, and promoted Schwann cells apoptosis.